Need for acute psychiatric hospitalization or is suicidal

The above is a clinical trial exclusion criterion. Annotated with entity spans:
[Observation: Need for] [Temporal: acute] [Procedure: psychiatric hospitalization] or is [Condition: suicidal]